Clinical trial exclusion criterion:
Allergy to porphyrins and analogues; Photosensitivity; Porphyria; Allergic constitution;

Annotated entities:
- Condition: "Allergy"
- Drug: "porphyrins"
- Condition: "Photosensitivity"
- Drug: "analogues"
- Condition: "Porphyria"
- Condition: "Allergic constitution"